下列何者不是醫療上判斷病人是否有「決定能力」的項目？
A. 病患是否滿20歲
B. 了解醫學問題的能力
C. 了解醫師建議療法的能力
D. 當拒絕所建議之療法時，能合理地預見其後果的能力

正確答案：A. 病患是否滿20歲